Clinical trial inclusion criterion:
Patients with diagnosis of cerebral palsy.

Annotated entities:
- Condition: "cerebral palsy"